2. Subject is pregnant or lactating or is attempting or expecting to become pregnant during the study

The above is a clinical trial exclusion criterion. Annotated with entity spans:
[Parsing_Error: 2.] Subject is [Condition: pregnant] or [Condition: lactating] or [Non-query-able: is attempting or expecting to become pregnant during the study]